Clinical trial exclusion criterion:
LA size > 50 mm (parasternal long axis view)

Annotated entities:
- Measurement: "LA size"
- Value: "> 50 mm"
- Qualifier: "parasternal long axis view"